Willing to participate

The above is a clinical trial inclusion criterion. Annotated with entity spans:
[Competing_trial: Willing to participate]